Participant has a history of epilepsy or fits or unexplained black-outs other than vasovagal collapse

The above is a clinical trial exclusion criterion. Annotated with entity spans:
Participant has a [Temporal: history] of [Condition: epilepsy] or [Condition: fits] or [Qualifier: unexplained] [Condition: black-outs] [Negation: other than] [Condition: vasovagal collapse]